一位病患如在運動早期就發生呼吸困難，其原因最不可能為：
A. 肺部有過高的死腔（dead space）
B. 過早發生乳酸堆積（lactic acidosis）
C. 血氧（oxygen saturation）下降
D. 卵圓孔穩定的左至右側分流（left to right shunt）

正確答案：D. 卵圓孔穩定的左至右側分流（left to right shunt）